Clinical trial inclusion criterion:
Current diagnosis of major depressive disorder (DSM-IV-TR), single episode, recurrent or chronic, without psychotic features, as detected by MINI and clinical exam.

Annotated entities:
- Condition: "major depressive disorder"
- Procedure: "DSM-IV-TR"
- Multiplier: "single episode"
- Multiplier: "recurrent"
- Multiplier: "chronic"
- Negation: "without"
- Condition: "psychotic features"
- Procedure: "MINI"
- Procedure: "clinical exam"